以下何種 sensory receptor 之活化可引發 crossed-extension reflex？
A. pacinian corpuscles
B. nociceptors
C. muscle spindle stretch receptors
D. osmoreceptors

正確答案：B. nociceptors